List the main salt-inducible kinases.

SIK1
SIK2
SIK3
HDAC4
HDAC5